Which is the main epigenetic difference between poised and constitutive enhancers?

Histone H3K27ac distinguishes active enhancers from inactive/poised enhancer elements containing H3K4me1 alone.